一20歲男士有隱睪症病史，因睪丸腫大求診。體格檢查發現雙邊鎖骨上淋巴結腫大和乳房女性化。在這個階段最不合適的檢查應為：
A. 血清甲型胎兒蛋白（AFP）
B. 血清β-人類絨毛膜促性腺激素（β-HCG）
C. 血清LDH
D. 乳房超音波

正確答案：D. 乳房超音波